31歲王小姐被診斷為全身性紅斑狼瘡併腎炎約7年，初發病時經過prednisolone與mycophenolate治療後，近5年 24小時尿蛋白都小於0.5克，血中creatinine為0.6 mg/dL，目前用藥為prednisolone每日5毫克加 hydroxychloroquine 200毫克。王小姐因近日即將結婚，有懷孕的計畫，所以到門診來諮詢是否需調整藥物。 下列何項臨床處置最為適當？
A. 將prednisolone換成等強度dexamethasone
B. 維持目前用藥不需改變
C. 停掉hydroxychloroquine
D. 加上azathioprine

正確答案：B. 維持目前用藥不需改變